radiation exposure exceeding 20mSv in last 12 months

The above is a clinical trial exclusion criterion. Annotated with entity spans:
[Condition: radiation exposure] [Value: exceeding 20mSv] [Temporal: in last 12 months]